Clinical trial exclusion criterion:
Pre-existent neutropenia (neutrophils <1,500/mm3) or thrombocytopenia (platelets < 90,000/mm3)

Entity relations:
- Has_qualifier("neutropenia", "Pre-existent")
- Has_value("neutrophils", "<1,500/mm3")
- Has_value("platelets", "< 90,000/mm3")
- AND("thrombocytopenia", "platelets")
- AND("neutropenia", "neutrophils")
- OR("neutropenia", "thrombocytopenia")